一位 25 歲年輕女性因上腹不適至胃腸科門診，服用藥物一段時間後發生乳房腫脹及泌乳情形，她有可能服用下列何種藥物？
A. antacid
B. proton pump inhibitor
C. metoclopramide
D. magnesium oxide

正確答案：C. metoclopramide